心臟病患血中膽固醇（cholesterol）過高，因此服用降膽固醇藥物 statin，下列何者為 statin 在此一狀況中最主要之作用機制？
A. statin 抑制膽固醇經腸道吸收
B. statin 抑制膽固醇的腸肝再循環（enterohepatic recirculation）
C. statin 抑制膽固醇合成反應的 HMG-CoA reductase
D. statin 抑制 low-density lipoprotein receptor 基因表現

正確答案：C. statin 抑制膽固醇合成反應的 HMG-CoA reductase